Clinical trial inclusion criterion:
Normal weight as defined by a Body Mass Index (BMI, weight in kg divided by the square of height in meters) of 18.0 to 30.0 kg/m2, extremes included

Annotated entities:
- Measurement: "Body Mass Index"
- Measurement: "BMI"
- Measurement: "weight in kg divided by the square of height in meters"
- Value: "18.0 to 30.0 kg/m2, extremes included"
- Condition: "Normal weight"